Currently prescribed a phosphodiesterase (PDE) inhibitors medication (ex: Viagra, Cialis, etc)

The above is a clinical trial exclusion criterion. Annotated with entity spans:
Currently prescribed a [Drug: phosphodiesterase (PDE) inhibitors] medication (ex: [Drug: Viagra], [Drug: Cialis], etc)